三十個月的兒童還不會說話，鑑別診斷不包括：
A. 選擇性不語症
B. 自閉症
C. 聽障
D. 智能不足

正確答案：A. 選擇性不語症